Peripheral vascular disease

The above is a clinical trial exclusion criterion. Annotated with entity spans:
[Condition: Peripheral vascular disease]